Una mujer de 35 años consulta por la aparición de unas lesiones máculo-papulosas en miembros superiores sin otros síntomas. La biopsia de una de ellas demuestra la presencia de granulomas no caseificantes. Los análisis de sangre son normales salvo una elevación de los niveles de enzima convertidora de la angiotensina (ECA). En la radiografía de tórax se detectan adenopatías hiliares bilaterales. ¿Cuál de las siguientes considera la actitud más adecuada?
1. Iniciar tratamiento con corticoides por      vía oral.
2. Iniciar tratamiento con hidroxicloroquina    por vía oral.
3. Iniciar tratamiento con azatioprina por      vía oral.
4. Iniciar tratamiento con leflunomida por      vía oral.
5. Continuar estudio sin iniciar tratamiento.

Respuesta correcta: 5. Continuar estudio sin iniciar tratamiento.